Clinical trial exclusion criteria:
Patients with systolic blood pressure <100 mmHg or basal heart rate <60/min
Portal vein thrombosis
Uncontrolled ascites or hepatic encephalopathy
Severe coagulation disorder: prothrombin time <40% (or INR >1.7) or platelet count <30,000/mm3
Medium or large sized gastric or duodenal varices
Coexisting malignancy
Severe cardiovascular disorder, renal failure, peritonitis, sepsis
Severe erosive esophagitis, severe esophageal stricture, active gastric or duodenal ulcer
Contraindication to beta-blocker
Pregnancy
Refusal to give consent to participate in the trial

Annotated entities:
- Measurement: "systolic blood pressure"
- Value: "<100 mmHg"
- Measurement: "heart rate"
- Qualifier: "basal"
- Value: "<60/min"
- Condition: "Portal vein thrombosis"
- Condition: "ascites"
- Condition: "hepatic encephalopathy"
- Qualifier: "Uncontrolled"
- Condition: "coagulation disorder"
- Qualifier: "Severe"
- Measurement: "prothrombin time"
- Value: "<40%"
- Measurement: "INR"
- Value: ">1.7"
- Measurement: "platelet count"
- Value: "<30,000/mm3"
- Condition: "duodenal varices"
- Condition: "gastric c"
- Qualifier: "large"
- Qualifier: "Medium"
- Condition: "malignancy"
- Qualifier: "Coexisting"
- Condition: "cardiovascular disorder"
- Qualifier: "Severe"
- Condition: "renal failure"
- Condition: "peritonitis"
- Condition: "sepsis"
- Condition: "erosive esophagitis"
- Condition: "esophageal stricture"
- Condition: "duodenal ulcer"
- Condition: "gastric ulcer"
- Qualifier: "active"
- Qualifier: "severe"
- Qualifier: "Severe"
- Condition: "Contraindication"
- Drug: "beta-blocker"
- Condition: "Pregnancy"
- Informed_consent: "Refusal to give consent to participate in the trial"